Clinical trial exclusion criterion:
Positive hepatitis C or hepatitis B surface antigen test and/or hepatits B core antibody test for immunoglobulin G (IgG) and/or immunoglobulin M (IgM).

Annotated entities:
- Value: "Positive"
- Measurement: "hepatitis C surface antigen test"
- Measurement: "hepatitis B surface antigen test"
- Measurement: "hepatits B core antibody test"
- Qualifier: "immunoglobulin G (IgG)"
- Qualifier: "immunoglobulin M (IgM)"